What is the purpose of the Tabix tool?

Tabix is the first generic tool that indexes position sorted files in tab-delimited formats such as gff , bed , psl , sam and sql export , and quickly retrieves features overlapping specified regions . Tabix is implemented as a free command-line tool as well as a library in c , java , perl and python .